Clinical trial exclusion criterion:
Estimated GFR <60 mL/min/1.73 m2 using the Cockcroft-Gault formula measurement of the individual parameters following at least 5 minutes of rest at Screening.

Annotated entities:
- Measurement: "Estimated GFR"
- Value: "<60 mL/min/1.73 m2"
- Observation: "Cockcroft-Gault formula"